Unable to comprehend consent material because of language barrier or psychological difficulty

The above is a clinical trial exclusion criterion. Annotated with entity spans:
[Subjective_judgement: Unable to comprehend consent material because of language barrier or psychological difficulty]